Clinical trial exclusion criterion:
History of an adverse reaction to Cortrosyn™ or similar test reagents

Annotated entities:
- Condition: "adverse reaction"
- Qualifier: "Cortrosyn"
- Drug: "Cortrosyn"
- Procedure: "test reagents"
- Qualifier: "similar"
- Qualifier: "similar test reagents"